Clinical trial exclusion criterion:
Previous propofol infusion rate >4 mg/kg/h

Entity relations:
- Has_value("propofol infusion rate", ">4 mg/kg/h")
- Has_temporal("propofol infusion rate", "Previous")